一位 5 歲罹患重型β型海洋性貧血症（β-thalassemia major）的孩童，下列處置那一項較不適當？
A. 使用減白血球之濃縮紅血球輸血
B. 最好在血色素為 9.5-10.5 g/dL 時，給予輸血
C. 立即切除脾臟
D. 需給予排鐵劑治療

正確答案：C. 立即切除脾臟